What is NTI, Nerve Tissue Contrast Index

The NTI is a ratio between the brightness levels of surrounding tissue and the median nerve, both calculated on the basis of a US image.